Clinical trial exclusion criterion:
Subject with an abnormal karyotype in favor of Turner syndrome or having a premutation of the FMR1 gene or a syndromic form

Entity relations:
- Subsumes("abnormal karyotype", "Turner syndrome")
- OR("abnormal karyotype", "syndromic form", "premutation of the FMR1 gene")